What does "28" stand for in the Disease Activity Score DAS28?

It stands for the Disease Activity Score 28 Joint Index (DAS28). It’s a measure of how active a patient is in regards to how active they are in relation to the DAS28.